Clinical trial exclusion criterion:
Abnormal coagulation profile: INR > 2.5 and/or PTT > 80

Annotated entities:
- Measurement: "coagulation profile"
- Value: "Abnormal"
- Condition: "Abnormal coagulation profile"
- Measurement: "INR"
- Value: "> 2.5"
- Measurement: "PTT"
- Value: "> 80"